Clinical trial inclusion criterion:
Intention to perform primary percutaneous coronary intervention;

Annotated entities:
- Condition: "percutaneous coronary intervention"
- Mood: "Intention to perform"
- Qualifier: "primary"